Chronic pain disorders

The above is a clinical trial exclusion criterion. Annotated with entity spans:
[Condition: Chronic pain] disorders